Clinical trial inclusion criterion:
At least one CTO lesions located in proximal or mid epicardial coronary artery. (If the patient has two CTO lesions, one CTO lesion should be located in proximal or mid epicardial coronary artery)

Entity relations:
- Has_multiplier("CTO lesions", "At least one")
- multi("mid epicardial coronary artery", "coronary artery")
- multi("in proximal coronary artery", "coronary artery")
- Has_qualifier("CTO lesions", "in proximal coronary artery")
- OR("in proximal coronary artery", "mid epicardial coronary artery")